Clinical trial inclusion criterion:
Females 18-65 years old who undergoing colposcopic directed biopsy

Annotated entities:
- Person: "Females"
- Value: "18-65 years"
- Person: "old"
- Procedure: "colposcopic directed biopsy"
- Temporal: "undergoing"